Clinical trial inclusion criterion:
Deformities or curvatures (including kyphosis, lordosis, or scoliosis)

Annotated entities:
- Condition: "Deformities"
- Condition: "curvatures"
- Condition: "kyphosis"
- Condition: "lordosis"
- Condition: "scoliosis"